下列有關Parvoviridae的敘述，何者錯誤？
A. Adenovirus-associated virus屬於這一科的病毒
B. 雙股DNA病毒
C. 沒有外	（envelope）
D. 結構屬於二十面體的病毒

正確答案：B. 雙股DNA病毒